Clinical trial exclusion criterion:
Has had a solid organ or hematologic transplant

Entity relations:
- OR("solid organ transplant", "hematologic transplant")